Creatinine less than or equal to 2.0 x upper limit of normal (ULN)

The above is a clinical trial inclusion criterion. Annotated with entity spans:
[Measurement: Creatinine] [Value: less than or equal to 2.0 x upper limit of normal (ULN)]